Clinical trial inclusion criterion:
Adequate hepatic, bone marrow, and renal function

Entity relations:
- Has_value("function hepatic", "Adequate")
- Has_value("bone marrow function", "Adequate")
- Has_value("renal function", "Adequate")